Clinical trial exclusion criterion:
Patients with baseline dementia

Annotated entities:
- Temporal: "baseline"
- Condition: "dementia"